List the ERM proteins.

ezrin
radixin
moesin